Clinical trial exclusion criterion:
Psychiatric, cognitive disorders, mental retardation;

Entity relations:
- OR("Psychiatric, cognitive disorders", "mental retardation")